Life expectancy should be greater than 6 months.

The above is a clinical trial inclusion criterion. Annotated with entity spans:
[Observation: Life expectancy] should be [Value: greater than 6 months].